Clinical trial exclusion criterion:
Heavily calcified or angulated lesion

Entity relations:
- Has_qualifier("lesion", "Heavily calcified")
- OR("Heavily calcified", "angulated")